What is SMiLE-seq?

Selective microfluidics-based ligand enrichment followed by sequencing (SMiLE-seq) is a semiautomated protein-DNA interaction characterization technology. SMiLE-seq is neither limited by DNA bait length nor biased toward strong affinity binders; it probes the DNA-binding properties of TFs over a wide affinity range in a fast and cost-effective fashion.